一位罹患躁鬱症（bipolar disorder）和氣喘的病人，偏頭痛變得越來越頻繁，目前一週會有兩三天的偏頭痛發作。醫師打算使用預防性藥物治療來減少她的偏頭痛，下列何種藥物是最合適的治療？
A. propranolol
B. divalproex
C. amitriptyline
D. lithium

正確答案：B. divalproex